Una clasificación de detectores de cromatografía de gases que comúnmente se encuentra en la bibliografía los divide en detectores de concentración y de masa, destructivos y no destructivos, integrales o diferenciales y universales o selectivos. Según esta clasificación:
1. El detector de conductividad térmica es un detector selectivo.
2. El detector de ionización en llama responde a la concentración del analito.
3. El detector de conductividad térmica responde a la concentración del analito.
4. El detector de fósforo y nitrógeno (NPD) es un detector universal.
5. El detector termocalorimétrico es de tipo diferencial.

Respuesta correcta: 3. El detector de conductividad térmica responde a la concentración del analito.